Women who are pregnant, nursing, or of child-bearing potential who are unwilling to use appropriate method(s) of contraception.

The above is a clinical trial exclusion criterion. Annotated with entity spans:
[Pregnancy_considerations: Women who are pregnant, nursing, or of child-bearing potential who are unwilling to use appropriate method(s) of contraception.]